FRC > 120 % predicted

The above is a clinical trial inclusion criterion. Annotated with entity spans:
[Measurement: FRC] [Value: > 120 % predicted]